Clinical trial exclusion criterion:
Major surgery within 14 days before enrollment.

Annotated entities:
- Procedure: "Major surgery"
- Temporal: "within 14 days before enrollment"